一位健康的人，於站立時由肺餘容積（residual volume）再開始吸氣時，此時空氣大部分會進入到那一個區域的肺泡？
A. 肺底處
B. 肺尖處
C. 肺中央處
D. 平均分布於全部

正確答案：B. 肺尖處